Which type of urinary incontinence is diagnosed with the Q tip test?

Stress urinary incontinence is diagnosed with the Q tip test. The test evaluates urethral mobility.